下列何種病毒之基因體為雙股 RNA？
A. 冠狀病毒（Coronavirus）
B. 乳頭瘤病毒（Papillomavirus）
C. 呼吸道腸道病毒（Reovirus）
D. 反轉錄病毒（Retrovirus）

正確答案：C. 呼吸道腸道病毒（Reovirus）